7. In the absence of the use of exogenous hormone(s), have a self-reported regular menstrual cycle defined as having a minimum of 21 days and a maximum of 36 days between menses

The above is a clinical trial inclusion criterion. Annotated with entity spans:
7. In the [Negation: absence] of the use of [Drug: exogenous hormone](s), have a self-reported [Condition: regular menstrual cycle] defined as having a [Value: minimum of 21 days] and a [Value: maximum of 36 days] between menses